下列那個胺基酸的代謝異常，最常導致白化症（Albinism）？
A. 離胺酸（lysine）
B. 精胺酸（arginine）
C. 色胺酸（tryptophan）
D. 酪胺酸（tyrosine）

正確答案：D. 酪胺酸（tyrosine）